Clinical trial exclusion criterion:
Renal dysfunction, including endogenous creatinine clearance male<120ml/min, female<105ml/min, serum creatinine=2mg/dl (186umol/L), Renal function progressive decline, GFR<30ml•min-1•1.73m-2;

Entity relations:
- Has_value("male", "<120ml/min")
- Has_value("female", "<105ml/min")
- Subsumes("=2mg/dl", "186umol/L")
- Has_value("serum creatinine", "=2mg/dl")
- Has_value("Renal function", "progressive decline")
- Has_value("GFR", "<30ml•min-1•1.73m-2")
- AND("endogenous creatinine clearance", "male")
- Subsumes("Renal dysfunction", "endogenous creatinine clearance")
- OR("male", "female")
- OR("endogenous creatinine clearance", "serum creatinine", "Renal function", "GFR")